一位68歲男性病患抽菸50年，10年前開始咳嗽且有黃痰，5年前開始出現運動性呼吸困難，最近3年有6次因為嚴重呼吸困難住院治療，其中4次被診斷為細菌性肺炎。本次住院在急診動脈血呈現PaO2 = 45 mmHg，PaCO2 = 70 mmHg，Resp. Rate = 30/min，病患被放置氣 管內管後使用呼吸器（ventilator）來維持呼吸。住院後一星期病患出現發燒、黃痰增多，胸部X光片於右下肺葉出現新的浸潤，痰液培養為Pseudomonas aeruginosa，下列敘述何者錯誤？
A. 診斷可為ventilator-associated pneumonia
B. 應該再輔以bronchoalveolar larvage或protected brush取得distal airways的檢體做
C. 使用monotherapy時aminoglycoside是首選有效的藥物
D. tobramycin（300 mg）inhaled daily可以提供氣管支氣管mucosa有效的drug-level，是施行抗生素吸入治療的推薦藥物

正確答案：C. 使用monotherapy時aminoglycoside是首選有效的藥物